Clinical trial exclusion criterion:
Organ dysfunction, and significant developmental delays or behavior problems

Annotated entities:
- Condition: "Organ dysfunction"
- Condition: "developmental delays"
- Qualifier: "significant"
- Condition: "behavior problems"